Clinical trial exclusion criterion:
Psychiatric troubles that do not allow the protocol follow-up.

Annotated entities:
- Condition: "Psychiatric troubles"
- Qualifier: "do not allow the protocol follow-up"